一位 40 歲男性接受健康檢查，發現 bilirubin（total/direct）為 3.0/0.4 mg/dL，下列何者最不可能是造成此病人膽紅素上升的原因？
A. glucose-6-phosphate dehydrogenase deficiency
B. 服用 rifampin
C. Gilbert's syndrome
D. Rotor's syndrome

正確答案：D. Rotor's syndrome